Clinical trial inclusion criterion:
Signed informed consent by patient self or legally authorized representatives.

Annotated entities:
- Informed_consent: "Signed informed consent by patient self or legally authorized representatives."